Son productores de muchos antibióticos de uso médico las (los):
1. Mixobacterias.
2. Cianobacterias.
3. Espiroquetas.
4. Estreptomicetos.
5. Proteobacterias alfa.

Respuesta correcta: 4. Estreptomicetos.